Clinical trial exclusion criteria:
Use of any investigational or non-registered product (drug or vaccine) other than the study vaccine(s) within 30 days preceding the first dose of study vaccine, or planned use during the study period
Chronic administration (defined as more than 14 days) of immunosuppressants or other immune-modifying drugs within six months prior to the first vaccine dose.
Planned administration/ administration of a vaccine not foreseen by the study protocol during the period starting one month before each dose of vaccine(s) and ending 7 days after dose 1 and dose 2 or 1 month after dose 3.
Previous vaccination against diphtheria, tetanus, pertussis, polio, hepatitis B, Haemophilus influenzae type b, and/or S. pneumoniae with the exception of vaccines where the first dose can be given within the first two weeks of life according to the national recommendations
History of or intercurrent diphtheria, tetanus, pertussis, hepatitis B, polio, and Haemophilus influenzae type b diseases.
History of allergic disease or reactions likely to be exacerbated by any component of the vaccines.
History of seizures (this criterion does not apply to subjects who have had a single, uncomplicated febrile convulsion in the past) or neurological disease.
Acute disease at the time of enrolment
Any confirmed or suspected immunosuppressive or immunodeficient condition based on medical history and physical
A family history of congenital or hereditary immunodeficiency.
Major congenital defects or serious chronic illness.
Administration of immunoglobulins and/or any blood products since birth or planned administration during the active phase of the study.

Annotated entities:
- Drug: "product any investigational other than the study vaccine(s)"
- Drug: "non-registered product any other than the study vaccine(s)"
- Drug: "drug"
- Drug: "vaccine"
- Temporal: "within 30 days"
- Mood: "planned use"
- Temporal: "during the study period"
- Drug: "immunosuppressants"
- Drug: "other immune-modifying drugs"
- Temporal: "within six months"
- Temporal: "Chronic"
- Temporal: "more than 14 days"
- Mood: "Planned"
- Drug: "vaccine"
- Qualifier: "not foreseen by the study protocol"
- Temporal: "period starting one month before each dose of vaccine(s)"
- Temporal: "1 month after dose 3"
- Temporal: "ending 7 days after dose 1 and dose 2"
- Drug: "dose 1"
- Drug: "dose 2"
- Drug: "dose 3"
- Reference_point: "each dose of vaccine(s)"
- Reference_point: "dose 1 and dose 2"
- Reference_point: "dose 3"
- Drug: "vaccination"
- Condition: "diphtheria"
- Condition: "tetanus"
- Condition: "pertussis"
- Condition: "polio"
- Condition: "hepatitis B"
- Condition: "Haemophilus influenzae type b"
- Condition: "S. pneumoniae"
- Temporal: "within the first two weeks of life"
- Qualifier: "first dose can be given"
- Drug: "vaccines"
- Negation: "with the exception of"
- Reference_point: "the first two weeks of life"
- Temporal: "History"
- Condition: "diphtheria"
- Condition: "tetanus"
- Condition: "pertussis"
- Condition: "hepatitis B"
- Condition: "polio"
- Condition: "Haemophilus influenzae type b"
- Condition: "allergic disease"
- Temporal: "History"
- Condition: "reactions allergic"
- Qualifier: "exacerbated"
- Condition: "seizures"
- Temporal: "History"
- Condition: "febrile convulsion"
- Qualifier: "uncomplicated"
- Multiplier: "single"
- Condition: "neurological disease"
- Negation: "does not apply"
- Condition: "Acute disease"
- Temporal: "at the time of enrolment"
- Reference_point: "enrolment"
- Condition: "immunosuppressive condition"
- Condition: "immunodeficient condition"
- Observation: "family history"
- Condition: "congenital immunodeficiency"
- Condition: "hereditary immunodeficiency"
- Condition: "Major congenital defects"
- Condition: "serious chronic illness"
- Drug: "immunoglobulins"
- Drug: "any blood products"
- Temporal: "since birth"
- Mood: "planned"
- Temporal: "during the active phase of the study"
- Reference_point: "active phase of the study"
- Reference_point: "birth"